Clinical trial exclusion criterion:
Most recent hCG > 5000 mIU/mL

Annotated entities:
- Measurement: "hCG"
- Temporal: "Most recent"
- Value: "> 5000 mIU/mL"